Clinical trial exclusion criterion:
Dysregulated thyroid diseases, use of antithyroid treatment.

Annotated entities:
- Qualifier: "Dysregulated"
- Condition: "thyroid diseases"
- Procedure: "antithyroid treatment"